Clinical trial exclusion criteria:
Ongoing serious bacterial infections at the time of screening.
Other significant medical conditions that could increase the risk to the subject.
Females who are pregnant, breast feeding, or planning a pregnancy during the course study.
Participation in a study with an Investigational Medicinal Product (IMP) other than IgPro20 within three months prior to enrollment.

Annotated entities:
- Condition: "bacterial infections"
- Qualifier: "serious"
- Temporal: "at the time of screening"
- Reference_point: "screening"
- Non-query-able: "Other significant medical conditions that could increase the risk to the subject"
- Pregnancy_considerations: "Females who are pregnant, breast feeding, or planning a pregnancy during the course study."
- Non-query-able: "Participation in a study with an Investigational Medicinal Product (IMP) other than IgPro20 within three months prior to enrollment."